Previous treatment with systemic corticosteroids or a change in dosage of thyroid hormones in the previous 6 weeks

The above is a clinical trial exclusion criterion. Annotated with entity spans:
Previous treatment with [Drug: systemic corticosteroids] or a [Qualifier: change in dosage] of [Drug: thyroid hormones] in the [Temporal: previous 6 weeks]